小男孩來就診，非常矮，頭看起來很大，四肢短短的。醫師的診斷是侏儒症（achondroplasia）。醫師記得這是一種體染色體顯性遺傳疾病，但是患童的父母親身高卻是正常的。最適合的解釋為何？
A. 醫師記錯了，侏儒症應該是隱性遺傳的
B. 父親其實不是很高，可能父親也有侏儒症，只是表現不完全
C. 隔代遺傳
D. 這個小男孩的疾病是來自新的突變

正確答案：D. 這個小男孩的疾病是來自新的突變